Clinical trial inclusion criterion:
New York Heart Association (NYHA) class of II - IV

Entity relations:
- Subsumes("New York Heart Association class", "NYHA")
- Has_value("New York Heart Association class", "II - IV")